6. In the past 2 months involved in other drugs or devices clinical trials

The above is a clinical trial exclusion criterion. Annotated with entity spans:
6. [Competing_trial: In the past 2 months involved in other drugs or devices clinical trials]